何種群落刺激因子（colony-stimulating factor，CSF）目前可適用於治療癌症化療所造成的骨髓抑制反應（myelosuppressive reaction），其名又稱 Filgrastim？
A. G-CSF
B. GM-CSF
C. Multi-CSF
D. M-CSF

正確答案：A. G-CSF